Which master regulator drives liver development?

The HNF4α plays a major role in liver development, but it's not the only factor. There's a lot of other factors that play a role, but that's the big one.